history of > 1 urogenital infection/year

The above is a clinical trial exclusion criterion. Annotated with entity spans:
history of [Multiplier: > 1] [Condition: urogenital infection]/year